Clinical trial exclusion criterion:
Known hypersensibility to coumadin or indoine derivatives or to any excipients (CI to oral AVK)

Annotated entities:
- Condition: "hypersensibility"
- Drug: "coumadin"
- Drug: "indoine"